Serum potassium < 3.5 mmol/L or >5.5 mmol/L

The above is a clinical trial exclusion criterion. Annotated with entity spans:
[Measurement: Serum potassium] [Value: < 3.5 mmol/L] or [Value: >5.5 mmol/L]